Clinical trial exclusion criterion:
Any metal in or on the body (that cannot be removed) between the nose and the abdomen

Entity relations:
- Has_qualifier("metal on the body", "between the nose and the abdomen")
- OR("metal on the body", "metal in the body")